Clinical trial exclusion criterion:
clinically significant peripheral vascular disease (previous surgery, amputation, or symptoms of claudication)

Entity relations:
- Has_qualifier("peripheral vascular disease", "clinically significant")
- Subsumes("peripheral vascular disease", "previous surgery")
- OR("previous surgery", "amputation", "symptoms of claudication")